El virus del resfriado común tiene un genoma:
1. DNA de cadena sencilla.
2. DNA de doble cadena.
3. Fragmentado.
4. RNA de cadena sencilla.
5. RNA de doble cadena.

Respuesta correcta: 4. RNA de cadena sencilla.